El diagnóstico de sarcoidosis se realiza en base a:
1. Cuadro clínico-radiológico compatible y presencia de granulomas no caseificantes en uno o más órganos, con cultivos de micobacterias y hongos negativos.
2. Elevación del nivel sérico de la enzima de conversión de la angiotensina en un paciente con un cuadro clínico-radiológico compatible.
3. Hallazgos radiológicos característicos en la tomografía axial computarizada de alta resolución de tórax en un paciente con sospecha clínica.
4. Presencia de alveolitis linfocitaria con predominio de linfocitos CD4+ en el lavado broncoalveolar en un paciente con un cuadro clínico-radiológico compatible.
5. Hallazgo de celularidad granulomatosa en una punción aspirativa con aguja fina (PAAF) de un órgano afecto en un paciente con un cuadro clínico-radiológico compatible.

Respuesta correcta: 1. Cuadro clínico-radiológico compatible y presencia de granulomas no caseificantes en uno o más órganos, con cultivos de micobacterias y hongos negativos.